2歲的男孩因不會講話而求診。他在1歲時可以放手走，現在會爬上下椅子。仍不會叫爸爸或媽媽，叫他不理人。有關其進一步的處置，下列何者敘述錯誤？
A. 應安排發展聯合評估
B. 應排除聽力障礙，做聽力檢查
C. 可能為自閉症的表徵
D. 應做腦部磁振造影檢查

正確答案：D. 應做腦部磁振造影檢查